How long in bp is the human pseudoautosomal region 2 (PAR2)?

The human pseudoautosomal region 2 (PAR2) is 320-kb long.